Clinical trial exclusion criterion:
Epilepsy;

Annotated entities:
- Condition: "Epilepsy"